Clinical trial inclusion criterion:
current regular user of e-cigarettes (use at least once daily for the past 30 days) with nicotine strength > 6mg/ml

Entity relations:
- Has_qualifier("user", "regular")
- Has_qualifier("user", "e-cigarettes")
- Has_multiplier("e-cigarettes", "at least once daily")
- Has_temporal("e-cigarettes", "for the past 30 days")
- Has_value("nicotine strength", "> 6mg/ml")
- AND("user", "nicotine strength")